Which protein is required for Argonaute 2 recruitment to stress granules and P-bodies?

Hsp90 regulates the function of argonaute 2 and its recruitment to stress granules and P-bodies.